Para el tratamiento de los síntomas positivos persistentes en la esquizofrenia la terapia psicológica indicada es:
1. La intervención familiar.
2. La psicoterapia psicodinámica.
3. La rehabilitación cognitiva.
4. La terapia cognitivo-conductual.

Respuesta correcta: 4. La terapia cognitivo-conductual.